若某工廠外洩毒性物質引起呼吸道傷害個案數呈現陡升陡降，此現象較符合何種流行曲線？
A. 混合流行（mixed epidemic）
B. 連鎖流行（propagated epidemic）
C. 共同病源流行（common source epidemic）
D. 週期循環流行（cyclic epidemic）

正確答案：C. 共同病源流行（common source epidemic）